Clinical trial exclusion criterion:
Patients who will not get surgical treatment for their endometrial cancer

Annotated entities:
- Negation: "not"
- Procedure: "surgical treatment"
- Condition: "endometrial cancer"